Clinical trial exclusion criterion:
History of statin intolerance to any other drug.

Annotated entities:
- Condition: "intolerance"
- Drug: "statin"